Clinical trial exclusion criterion:
Underlying Rheumatoid arthritis, stroke, malignancy, venous occlusion

Annotated entities:
- Condition: "Rheumatoid arthritis"
- Condition: "stroke"
- Condition: "malignancy"
- Condition: "venous occlusion"
- Qualifier: "Underlying"